Clinical trial exclusion criterion:
Ocular surface or annexes metaplastic lesions

Entity relations:
- OR("annexes metaplastic lesions Ocular", "lesions Ocular surface")